Clinical trial exclusion criterion:
Patients known to be colonized with Methicillin-resistant S. aureus (MRSA)(unethical not to administer glycopeptides), beta-lactam or vancomycin allergy precluding the use of cefazolin or vancomycin, respectively, or to silver precluding the use of Prevena

Annotated entities:
- Qualifier: "Methicillin-resistant S. aureus (MRSA)"
- Condition: "colonized"
- Non-representable: "(unethical not to administer glycopeptides)"
- Drug: "beta-lactam"
- Drug: "vancomycin"
- Condition: "allergy"
- Drug: "cefazolin"
- Drug: "vancomycin"
- Drug: "silver"